Clinical trial exclusion criterion:
Patients with diabetes, autoimmune diseases.

Annotated entities:
- Condition: "diabetes"
- Condition: "autoimmune diseases"